Presence of relative or absolute contraindications to CPFA

The above is a clinical trial exclusion criterion. Annotated with entity spans:
Presence of [Condition: relative] or [Condition: absolute contraindications] to [Procedure: CPFA]